Clinical trial exclusion criterion:
Use of hormone replacement therapy or hormonal contraceptive agents within days prior to surgery

Entity relations:
- Has_index("within days prior to surgery", "surgery")
- Has_temporal("hormone replacement therapy", "within days prior to surgery")
- OR("hormone replacement therapy", "hormonal contraceptive agents")